Clinical trial exclusion criterion:
HIV regimens containing tenofovir or tipranavir/ritonavir

Annotated entities:
- Non-query-able: "HIV regimens"
- Drug: "tenofovir"
- Drug: "tipranavir/ritonavir"